退化性骨關節炎（degenerative osteoarthritis）病人之影像學檢查的典型表現，以下何者最不可能？
A. 局部關節腔狹窄（localized joint-space narrowing）
B. 邊緣骨刺形成（marginal osteophytosis）
C. 有突出邊緣之關節周圍糜蝕（periarticular erosion with overhanging edge）
D. 軟骨下硬化及囊腫形成（subchondral sclerosis and cyst formation）

正確答案：C. 有突出邊緣之關節周圍糜蝕（periarticular erosion with overhanging edge）